關於原發性氣胸（primary pneumothorax）的敘述，何者錯誤？
A. 診斷可由病史、理學檢查及X光確定
B. CT routine不需要
C. 慢性阻塞肺病（COPD）引起的氣胸為續發性（secondary）氣胸
D. 插胸管是絕對需要的

正確答案：D. 插胸管是絕對需要的